Clinical trial exclusion criterion:
Pregnant or breast feeding women

Entity relations:
- OR("Pregnant", "breast")